關於呼吸道處理，下列敘述何者錯誤？
A. 對於有頭頸部嚴重外傷且意識不清之患者，維持呼吸道時應使用推拉下頜之技巧（jaw thrust
B. 顱底骨折（Basal skull fracture）患者不應使用鼻咽呼吸道（Nasopharyngeal airway）
C. 成年女性患者接受氣管插管時，施救者可選擇 7 毫米內徑的氣管內管
D. 使用喉鏡（Laryngoscope）時，對於慣用左手者，應用左手拿氣管內管，看準聲門（vocal cord）的位置並將它置入氣管內

正確答案：D. 使用喉鏡（Laryngoscope）時，對於慣用左手者，應用左手拿氣管內管，看準聲門（vocal cord）的位置並將它置入氣管內